La reactividad de diversos grupos carbonilo está determinada por su estabilidad relativa. El orden de reactividad hacia los nucleófilos es:
1. Amidas > Ésteres > Cetonas > Aldehídos.
2. Aldehídos > Cetonas > Ésteres > Amidas.
3. Amidas > Cetonas > Aldehídos > Ésteres.
4. Aldehídos > Ésteres > Cetonas > Amidas.
5. Amidas > Cetonas > Ésteres > Aldehídos.

Respuesta correcta: 2. Aldehídos > Cetonas > Ésteres > Amidas.